Clinically stable and on stable triple therapy with an ICS/LABA and tiotropium;

The above is a clinical trial inclusion criterion. Annotated with entity spans:
[Condition: Clinically stable] and on [Procedure: stable triple therapy] with an [Drug: ICS/LABA] and [Drug: tiotropium];